Psychotic depression by DSM-IV, i.e., presence of delusions with a SCID-R score higher than 2;

The above is a clinical trial exclusion criterion. Annotated with entity spans:
[Condition: Psychotic depression] by [Qualifier: DSM-IV], i.e., presence of [Condition: delusions] with a [Measurement: SCID-R score] [Value: higher than 2];